一位 15 個月大的男嬰因為發燒、流口水和拒絕喝奶就醫。過去健康狀況良好，家人沒有生病。此男嬰精神略顯煩躁但可被安撫，Temp 38.9℃，HR 140/min。手掌和腳掌有一些小而淺的水，臀部出現淺紅色的斑丘疹，後咽部和舌下出現數個水，嘴唇沒有水。最可能的診斷是：
A. 水痘（varicella）
B. 麻疹（measles）
C. 手足口症（hand-foot-mouth disease）
D. 猩紅熱（scarlet fever）

正確答案：C. 手足口症（hand-foot-mouth disease）